Other contraindication to cetirizine

The above is a clinical trial exclusion criterion. Annotated with entity spans:
Other [Condition: contraindication] to [Drug: cetirizine]